Clinical trial inclusion criterion:
Acute brain Severe injury

Annotated entities:
- Condition: "Acute brain Severe injury"